Una complicación del trasplante de precursores hematopoyéticos es:
1. La inmunodeficiencia común variable.
2. La enfermedad de injerto-contra-huésped.
3. Inmunodeficiencias en componentes del complemento.
4. La carencia de linfocitos NK.
5. La enfermedad granulomatosa crónica.

Respuesta correcta: 2. La enfermedad de injerto-contra-huésped.